Which Janus kinase does decernotinib target?

Decernotinib (VX-509) is a potent and selective inhibitor of janus kinase 3 (JAK3).